有關胰島素注射技術的敘述，何者錯誤？
A. 不宜在固定部位長期連續注射
B. 可在腹部、上臂、大腿或臀部之部位予以皮下注射
C. Lispro 胰島素可在進餐前 10 分鐘內注射
D. 胰島素一般以肌肉注射為主

正確答案：D. 胰島素一般以肌肉注射為主